Clinical trial exclusion criterion:
Coagulation disturbances not normalized by medical treatment

Annotated entities:
- Condition: "Coagulation disturbances"
- Undefined_semantics: "Coagulation disturbances"
- Procedure: "medical treatment"
- Qualifier: "normalized"
- Negation: "not"